Clinical trial exclusion criterion:
Allergy to gonadotrophins

Entity relations:
- AND("Allergy", "gonadotrophins")